下列那種治療對於腦性麻痺患者的肌肉痙攣（spasticity）並無證據顯示具有確定療效？
A. 支架（orthotics）
B. 脊椎腔內 Baclofen 注射
C. 高壓氧治療（hyperbaric oxygen therapy）
D. 肉毒桿菌毒素（botulinum toxin）注射

正確答案：C. 高壓氧治療（hyperbaric oxygen therapy）